Clinical trial exclusion criterion:
Participation in other studies that may interfere with this trial

Annotated entities:
- Competing_trial: "Participation in other studies that may interfere with this trial"